Clinical trial exclusion criterion:
1. Prior treatment with gemcitabine, carboplatin (except in the adjuvant setting), or Iniparib.

Entity relations:
- Has_temporal("gemcitabine", "Prior")
- OR("gemcitabine", "carboplatin", "Iniparib")